Severe Iron deficiency anemia (hemoglobin < 8.0 g/dL).

The above is a clinical trial exclusion criterion. Annotated with entity spans:
[Qualifier: Severe] [Condition: Iron deficiency anemia] ([Measurement: hemoglobin] [Value: < 8.0 g/dL]).